Clinical trial exclusion criterion:
Corrected (adjusted for serum albumin) serum calcium concentration < 8.0 mg/dl (2.00 mmol/L) or ≥ 12.0 mg/dl (3.00 mmol/L).

Annotated entities:
- Measurement: "Corrected serum calcium concentration"
- Value: "< 8.0 mg/dl"
- Value: "2.00 mmol/L"
- Value: "≥ 12.0 mg/dl"
- Value: "3.00 mmol/L"